Clinical trial inclusion criterion:
Voluntarily participated and Written informed consent signed

Annotated entities:
- Observation: "Written informed consent signed"
- Observation: "Voluntarily participated"